Able to participate in the full 2 years of treatment

The above is a clinical trial inclusion criterion. Annotated with entity spans:
[Observation: Able to participate] in the [Multiplier: full 2 years] of [Procedure: treatment]